Clinical trial inclusion criterion:
Presence of documented ST-elevation myocardial infarction confirmed by ECG, as well as troponin I and CK-MB levels.

Annotated entities:
- Condition: "ST-elevation myocardial infarction"
- Procedure: "ECG"
- Measurement: "troponin I"
- Measurement: "CK-MB"